Clinical trial inclusion criterion:
Male subjects (whether surgically sterilized or not) with female partners of child-bearing potential must use two forms of contraception, one of which must be a barrier method, for the duration of the study and for 77 days after the last dose

Annotated entities:
- Person: "Male"
- Condition: "surgically sterilized"
- Condition: "surgically sterilized"
- Negation: "not"
- Person: "female"
- Condition: "child-bearing potential"
- Multiplier: "two"
- Device: "forms of contraception"
- Undefined_semantics: "forms of contraception"
- Device: "barrier method"
- Temporal: "for the duration of the study"
- Temporal: "for 77 days after the last dose"
- Reference_point: "the last dose"
- Reference_point: "the study"